Clinical trial exclusion criterion:
medications changing notably paracetamol (acetaminophen) and/or ropivacaine metabolism in regular use

Entity relations:
- Subsumes("paracetamol", "acetaminophen")
- Has_multiplier("paracetamol", "regular use")
- OR("paracetamol", "ropivacaine")